What class of drugs frequently has muscle pain and other muscle toxicities such as mysositis and rhabdomyolysis as a side effect?

The most commonly experienced side-effect of statin medication is muscle pain